Fluoxetine 被用來治療憂鬱症（Depression），是與下列何種神經傳遞物質有關？
A. Norepinephrine
B. Dopamine
C. Serotonin
D. Histamine

正確答案：C. Serotonin